Clinical trial inclusion criterion:
Inclusion Criteria Patients: Fulfilling the diagnostic criteria of schizophrenia or schizoaffective disorder according to ICD-10 (International Classification of Diseases version 10) or DSM-IV/V (Diagnostic and Statistical Manual version 4 /5), Age 18-45 years, Never treated with antipsychotic compounds or central nervous system (CNS) stimulants, Legally competent

Annotated entities:
- Observation: "Patients"
- Condition: "schizophrenia"
- Condition: "schizoaffective disorder"
- Qualifier: "ICD-10 (International Classification of Diseases version 10)"
- Qualifier: "DSM-IV/V (Diagnostic and Statistical Manual version 4 /5)"
- Person: "Age"
- Value: "18-45 years"
- Negation: "Never"
- Drug: "antipsychotic compounds"
- Drug: "central nervous system (CNS) stimulants"
- Observation: "Legally competent"